Pregnancy or breast feeding

The above is a clinical trial exclusion criterion. Annotated with entity spans:
[Condition: Pregnancy] or [Observation: breast feeding]